History of head injury or stroke,

The above is a clinical trial exclusion criterion. Annotated with entity spans:
[Temporal: History] of [Condition: head injury] or [Condition: stroke],